Presence, or removal within the last 12 hours, of an epidural or spinal catheter, or recent (within the last 12 hours) epidural or spinal anesthesia/procedures

The above is a clinical trial exclusion criterion. Annotated with entity spans:
[Condition: Presence], or [Procedure: removal] [Temporal: within the last 12 hours], of an epidural or spinal catheter, or [Temporal: recent] ([Temporal: within the last 12 hours]) [Procedure: epidural] or [Procedure: spinal anesthesia]/procedures